Clinical trial exclusion criterion:
Patients who meet DSM-IV-TR criteria for any significant current substance abuse;

Entity relations:
- AND("DSM-IV-TR", "substance abuse")